Clinical trial exclusion criterion:
Body mass index (BMI)range 20-50 (excluding all women with BMI under 20 or over 50).

Annotated entities:
- Measurement: "Body mass index (BMI)"
- Value: "range 20-50"
- Parsing_Error: "(excluding all women with BMI under 20 or over 50)"